Intetumumab has been tested in clinical trials for treatment of which cancers?

Intetumumab has been tested in clinical trials for treatment of prostate cancer, melanoma and angiosarcoma.